have received influenza vaccination within the past 6 months

The above is a clinical trial exclusion criterion. Annotated with entity spans:
have received [Drug: influenza vaccination] [Temporal: within the past 6 months]